Sintetizan una única poliproteína precursora de todas las proteínas necesarias para el resto del ciclo de multiplicación los:
1. Coronavirus.
2. Picornavirus.
3. Rotavirus.
4. Paramixovirus.
5. Calcivirus.

Respuesta correcta: 2. Picornavirus.